Clinical trial inclusion criteria:
Patients who meet 1987 ACR criteria for SLE with 1996 modifications
SLEDAI >/= 6 at screening visit
Positive ANA OR anti-dsDNA within one year of screening
In the opinion of the investigator there is intent to treat with a biologic (e.g. patient failed standard of care treatment) however there is no organ threatening disease

Annotated entities:
- Measurement: "1987 ACR criteria with 1996 modifications"
- Condition: "SLE"
- Measurement: "SLEDAI"
- Value: ">/= 6"
- Temporal: "at screening visit"
- Reference_point: "screening visit"
- Measurement: "ANA"
- Value: "Positive"
- Measurement: "anti-dsDNA"
- Temporal: "within one year of screening"
- Reference_point: "screening"
- Subjective_judgement: "In the opinion of the investigator there is intent to treat with a biologic (e.g. patient failed standard of care treatment) however there is no organ threatening disease"